Body weight >= 50 kilogram (kg) and body mass index within the range 19 - 24.9 kg/m^2 (inclusive).

The above is a clinical trial inclusion criterion. Annotated with entity spans:
[Measurement: Body weight] [Value: >= 50 kilogram (kg)] and [Measurement: body mass index] [Value: within the range 19 - 24.9 kg/m^2] (inclusive).